Life expectancy of >12 weeks.

The above is a clinical trial inclusion criterion. Annotated with entity spans:
[Observation: Life expectancy] of [Value: >12 weeks].